Clinical trial exclusion criterion:
Patients who have taken antidepressants or anti-epileptic drugs, sedative hypnotics, selective serotonin reuptake inhibitor, short-acting analgesics, topical medications and anesthetics and/or muscle relaxants when taking Tramadol/Acetaminophen

Entity relations:
- Has_index("when taking Tramadol/Acetaminophen", "taking Tramadol/Acetaminophen")
- Has_temporal("antidepressants", "when taking Tramadol/Acetaminophen")
- OR("antidepressants", "anti-epileptic drugs", "sedative hypnotics", "selective serotonin reuptake inhibitor", "short-acting analgesics", "topical medications", "anesthetics", "muscle relaxants")
- OR("Tramadol", "Acetaminophen")